What is CRAO in the context of the eye?

central retinal artery occlusion (CRAO) is an ophthalmological emergency, the retinal analog of a stroke.